Uncontrolled diabetes mellitus

The above is a clinical trial exclusion criterion. Annotated with entity spans:
[Qualifier: Uncontrolled] [Condition: diabetes mellitus]